9. Patients who have previously received AC220

The above is a clinical trial exclusion criterion. Annotated with entity spans:
9. Patients who have previously received [Drug: AC220]